Clinical trial inclusion criterion:
(1)= 45 years old;

Entity relations:
- Has_value("old", "= 45 years")